El virión de los retrovirus:
1. Tiene forma helicoidal.
2. Tiene forma icosaédrica.
3. Contiene una sola copia de su genoma.
4. Contiene dos copias de su genoma.
5. Contiene un genoma segmentado.

Respuesta correcta: 4. Contiene dos copias de su genoma.